El ligando de Fas (FasL):
1. Induce apoptosis.
2. Induce al cambio isotípico de las inmunoglobulinas.
3. Determina maduración en la afinidad de los anticuerpos.
4. Media la exocitosis de perforina.

Respuesta correcta: 1. Induce apoptosis.